Clinical trial exclusion criterion:
Significant, non-reversible active pulmonary disease (e.g. cystic fibrosis, bronchiectasis, tuberculosis).

Entity relations:
- Has_qualifier("pulmonary disease", "non-reversible")
- Has_qualifier("pulmonary disease", "Significant")
- Has_temporal("pulmonary disease", "active")
- Subsumes("pulmonary disease", "cystic fibrosis")
- OR("cystic fibrosis", "bronchiectasis", "tuberculosis")